Clinical trial inclusion criterion:
Diagnosis of T2DM before the age of 60 years of age

Annotated entities:
- Condition: "T2DM"
- Person: "age"
- Value: "before 60 years of age"